下列何者與日本血吸蟲（Schistosoma japonicum）或其在患者引起的疾病無關？
A. 尾幼（cercariae）
B. 囊幼（metacercariae）
C. 肉芽腫（granulomas）
D. 片山熱（Katayama fever）

正確答案：B. 囊幼（metacercariae）